Clinical trial exclusion criterion:
Severe hepatic impairment (eg, ascites and/or clinical signs of coagulopathy)

Annotated entities:
- Condition: "Severe hepatic impairment"
- Condition: "ascites"
- Condition: "coagulopathy"
- Mood: "clinical signs of"